Clinical trial inclusion criterion:
Concomitant use of simvastatin/lovastatin > 40 mg qd

Annotated entities:
- Drug: "simvastatin"
- Drug: "lovastatin"
- Multiplier: "> 40 mg qd"
- Temporal: "Concomitant"